Clinical trial exclusion criterion:
Current use of Monoamine Oxidase Inhibitors (MAOIs), including the antibiotic linezolid and the thiazine dye methylthioninium chloride (methylene blue)

Annotated entities:
- Drug: "Monoamine Oxidase Inhibitors (MAOIs)"
- Drug: "antibiotic linezolid"
- Drug: "thiazine dye"
- Drug: "methylthioninium chloride"
- Drug: "methylene blue"